下列何者與缺血性腦中風（ischemic stroke）之成因較無關？
A. 頸動脈硬化斑塊（carotid atherosclerotic plaque）
B. 腦動脈瘤（cerebral aneurysm）
C. 心房顫動（atrial fibrillation）
D. 心內血栓（intracardiac thrombi）

正確答案：B. 腦動脈瘤（cerebral aneurysm）